肺癌病人合併肋膜腔積水，細胞學檢查發現有肺癌細胞轉移，下列敘述何者最正確？
A. 腫瘤細胞多半經由血液轉移
B. 腫瘤細胞多半經由淋巴轉移
C. 腫瘤細胞多半經由直接侵襲或播種方式轉移
D. 以鱗狀細胞癌最常見

正確答案：C. 腫瘤細胞多半經由直接侵襲或播種方式轉移